Clinical trial exclusion criterion:
Intelligence quotient (IQ) < 70

Entity relations:
- Subsumes("Intelligence quotient", "IQ")
- Has_value("Intelligence quotient", "< 70")